Clinical trial inclusion criterion:
symptoms of menometrorrhagia,

Entity relations:
- Has_mood("menometrorrhagia", "symptoms")